Uterine abnormalities or myoma.

The above is a clinical trial exclusion criterion. Annotated with entity spans:
[Condition: Uterine abnormalities] or [Condition: myoma].